Clinical trial exclusion criterion:
Subjects were not to have had an abnormal diet or substantial changes in eating habits within 30 days prior to study initiation.

Entity relations:
- Has_qualifier("changes in eating habits", "substantial")
- Has_index("within 30 days prior to study initiation", "study initiation")
- Has_negation("abnormal diet", "not")
- Has_temporal("abnormal diet", "within 30 days prior to study initiation")
- OR("abnormal diet", "changes in eating habits")